Clinical trial inclusion criterion:
2. Healthy, premenopausal female age 18-47;

Entity relations:
- Has_value("age", "18-47")